Clinical trial inclusion criterion:
Suffer from schizophrenia/schizoaffective disorder meeting Diagnostic and Statistical Manual of Mental Disorders, Fourth Edition, Text Revision (DSM-IV-TR) criteria;

Entity relations:
- Subsumes("Diagnostic and Statistical Manual of Mental Disorders, Fourth Edition, Text Revision", "DSM-IV-TR")
- OR("schizophrenia", "schizoaffective disorder")